發生人類後天免疫缺乏病毒（HIV）母子傳染最主要時期為：
A. 第一及第二妊娠期
B. 第三妊娠期
C. 分娩
D. 哺乳

正確答案：C. 分娩